一位 32 歲病患因發燒、喘、輕微咳嗽已 10 天至急診求診，體溫 39.4℃，心跳 108 次/分，呼吸 26 次/分，白血球 26000/mm3，胸部X光顯示多處不規則結節狀肺浸潤，其手指末端及腳底可見暗紅色斑點，此時應進行何種檢查最能確立診斷？
A. 二維（2-D）心臟超音波
B. 胸部電腦斷層掃描
C. 腹部超音波
D. 動脈血管攝影

正確答案：A. 二維（2-D）心臟超音波